History of any chemotherapy for MBC.

The above is a clinical trial exclusion criterion. Annotated with entity spans:
[Temporal: History] of any [Procedure: chemotherapy] for [Condition: MBC].